Tobacco use within 3 months of enrollment and throughout first 6 months of the study

The above is a clinical trial exclusion criterion. Annotated with entity spans:
[Condition: Tobacco use] [Temporal: within 3 months of enrollment] and [Temporal: throughout first 6 months of the study]